Clinical trial inclusion criterion:
Best corrected visual acuity (BCVA) of 20/50 to 20/320 ETDRS equivalent (65 letters to 23 letters) in the study eye, with BCVA decrement primarily attributable to DME.

Entity relations:
- Subsumes("20/50 to 20/320 ETDRS equivalent", "65 letters to 23 letters")
- Has_qualifier("Best corrected visual acuity (BCVA)", "in the study eye")
- Has_value("Best corrected visual acuity (BCVA)", "20/50 to 20/320 ETDRS equivalent")